Clinical trial exclusion criteria:
Active or past psychotic disorder, including a history of psychotic affective state
Mental Retardation or Autistic Spectrum Disorder
Prominent personality disorder
Cardiac or neurologic active medical condition, including past CVA/TIA (Cardiovascular Accident/Transient Ischemic Attack) or any other unstable medical condition.
Chronic nasal congestion
Active or recent drug or alcohol abuse
Substantial suicidality in a patient requiring admission but refuses to do so, and signs an "against medical advice" release form as part of clinical evaluation, and does not answer the terms for involuntary admission.

Annotated entities:
- Condition: "psychotic disorder"
- Condition: "psychotic affective state"
- Temporal: "Active"
- Temporal: "past"
- Condition: "Mental Retardation"
- Condition: "Autistic Spectrum Disorder"
- Condition: "Prominent personality disorder"
- Condition: "neurologic active medical condition"
- Condition: "Cardiac active medical condition"
- Condition: "CVA"
- Condition: "TIA"
- Temporal: "past"
- Condition: "Cardiovascular Accident"
- Condition: "Transient Ischemic Attack"
- Qualifier: "unstable"
- Condition: "medical condition"
- Condition: "nasal congestion"
- Temporal: "Chronic"
- Condition: "alcohol abuse"
- Temporal: "recent"
- Temporal: "Active"
- Condition: "drug abuse"
- Condition: "suicidality"
- Qualifier: "Substantial"
- Procedure: "admission"
- Non-representable: "signs an "against medical advice" release form as part of clinical evaluation, and does not answer the terms for involuntary admission"